急性心肌梗塞時，如果併發 accelerated idioventricular rhythm，最適當的處理方式是：
A. 電擊心臟使之恢復竇性心律
B. xylocaine 靜脈注射
C. amiodarone 靜脈注射
D. 密切監測即可

正確答案：D. 密切監測即可